下列何者是造成hyperthyroidism病症最常見的可能原因是？
A. Graves' disease
B. Hashimoto's disease
C. 碘攝取不足
D. 腦部外傷

正確答案：A. Graves' disease